Clinical trial exclusion criterion:
16. Neuropsychiatric disorders/symptoms or psychological conditions.

Entity relations:
- OR("Neuropsychiatric disorders", "psychological conditions", "Neuropsychiatric symptoms")